¿Cuál de las siguientes afirmaciones respecto a los Trastornos de la Conducta Alimentaria es cierta?
1. En la anorexia nerviosa tipo restrictivo existen estrategias compensatorias de carácter no purgativo, como la cumplimentación de dietas/ayuno y el ejercicio intenso.
2. El paciente con anorexia nerviosa no presenta en ningún caso episodios de atracón.
3. El paciente con bulimia nerviosa al contrario que el paciente con anorexia nerviosa con su conducta no tiene intención de adelgazar.
4. Las alteraciones en la conducta alimentaria no afectan a la cognición de los pacientes.
5. Las relaciones interpersonales son una de las pocas áreas que no se ven alteradas en los trastornos de la conducta alimentaria.

Respuesta correcta: 1. En la anorexia nerviosa tipo restrictivo existen estrategias compensatorias de carácter no purgativo, como la cumplimentación de dietas/ayuno y el ejercicio intenso.